Clinical trial exclusion criterion:
Current or previous, within the 60 days preceding the baseline visit (Visit 2), treatment with antimuscarinic agents for OAB symptoms; and, willingness to not use antimuscarinic agents for the duration of the study.

Entity relations:
- AND("antimuscarinic agents", "OAB symptoms")
- Has_index("within the 60 days preceding the baseline visit", "baseline visit")
- Has_temporal("antimuscarinic agents", "within the 60 days preceding the baseline visit")